Clinical trial exclusion criterion:
unable to participate in a discussion about the study

Annotated entities:
- Non-query-able: "unable to participate in a discussion about the study"